Hemoglobin (Hb) < 8 g/dL

The above is a clinical trial exclusion criterion. Annotated with entity spans:
[Measurement: Hemoglobin] ([Measurement: Hb]) [Value: < 8 g/dL]